Clinical trial inclusion criterion:
1. Diagnosis of primary immunodeficiency with established plan to undergo myeloablative or non-myeloablative allogeneic hematopoietic stem cell transplant for treatment thereof or diagnosis of a form of primary immunodeficiency for which hematopoietic stem cell transplantation is not indicated.

Entity relations:
- Has_negation("hematopoietic stem cell transplantation", "not indicated")
- AND("primary immunodeficiency", "hematopoietic stem cell transplantation")
- AND("primary immunodeficiency", "non-myeloablative allogeneic hematopoietic stem cell transplant")
- OR("non-myeloablative allogeneic hematopoietic stem cell transplant", "allogeneic hematopoietic stem cell transplant myeloablative")
- OR("primary immunodeficiency", "primary immunodeficiency")